¿Cuál de las siguientes acciones ejerce la insulina sobre el tejido hepático?
1. Inhibe la captación de glucosa.
2. Activa la lipolisis.
3. Inhibe la síntesis de ácidos grasos.
4. Activa la síntesis de glucógeno.
5. Activa la glucogenolisis.

Respuesta correcta: 4. Activa la síntesis de glucógeno.